In self-reported menopause, defined as the permanent cessation of ovulation, for at least one year (Soules et al., 2001).

The above is a clinical trial inclusion criterion. Annotated with entity spans:
In self-reported [Condition: menopause], defined as the [Qualifier: permanent] [Condition: cessation of ovulation], for [Temporal: at least one year] (Soules et al., 2001).